Clinical trial exclusion criterion:
Patient with contraindication to misoprostol or vasopressin, personal history or cardiac or pulmonary disease, history of prior myomectomy

Annotated entities:
- Drug: "misoprostol"
- Drug: "vasopressin"
- Condition: "contraindication"
- Temporal: "personal history"
- Condition: "disease cardiac"
- Condition: "pulmonary disease"
- Temporal: "history"
- Temporal: "prior"
- Procedure: "myomectomy"